Clinical trial inclusion criterion:
Availability to go to each revision when indicated.

Annotated entities:
- Post-eligibility: "Availability to go to each revision when indicated."